將一莫耳（mole）葡萄糖經由糖解作用（glycolysis）產生兩莫耳丙酮酸（pyruvate）的過程中，淨需要：
A. 四莫耳ATP
B. 一莫耳NAD+
C. 一莫耳磷酸根（inorganic phosphate）
D. 兩莫耳ADP

正確答案：D. 兩莫耳ADP